Clinical trial exclusion criterion:
Admission from an other ICU where the patient remained for more than 24 hours

Annotated entities:
- Procedure: "Admission"
- Visit: "an other ICU"
- Observation: "patient remained"
- Multiplier: "for more than 24 hours"